Hepatitis B e antigen (HBeAg)-negative and anti-HBeAg positive.

The above is a clinical trial inclusion criterion. Annotated with entity spans:
[Measurement: Hepatitis B e antigen] ([Measurement: HBeAg])-[Value: negative] and [Measurement: anti-HBeAg] [Value: positive].